Clinical trial inclusion criterion:
Birthweight >2500g

Annotated entities:
- Measurement: "Birthweight"
- Value: ">2500g"